Clinical trial exclusion criterion:
any prior adverse response to lisdexamfetamine dimesylate or other stimulant medication

Entity relations:
- Has_qualifier("stimulant medication", "other")
- AND("adverse response", "lisdexamfetamine dimesylate")
- Has_temporal("adverse response", "prior")
- OR("lisdexamfetamine dimesylate", "stimulant medication")